What classes of drugs does Retapamulin belong to?

Pleuromutilins have a potential to be developed as a new class of antibiotics for  use in humans. This class includes valnemulin, tiamulin, and retapamulin.